Clinical trial exclusion criterion:
No frozen embryos after IVF cycle

Annotated entities:
- Procedure: "IVF cycle"
- Negation: "No"
- Observation: "frozen embryos"